Clinical trial exclusion criteria:
Patient diagnosed with dementia.
Patients with serious and unstable illnesses including current hepatic, renal, gastroenterologic, respiratory, cardiovascular (including ischemic heart disease and congestive heart failure), endocrinologic, neurologic (including stroke, transient ischemic attack, subarachnoidal bleeding, brain tumor, encephalopathy, and meningitis).
Patients with a history of allergic reactions to loxapine or amoxapine
Patients who have received an investigational drug within 30 days prior to the current agitation episode must be excluded.
Patients who are considered by the investigator, for any reason, to be unable to self-administer the inhalation device.

Annotated entities:
- Condition: "dementia"
- Qualifier: "serious"
- Qualifier: "unstable"
- Condition: "hepatic"
- Condition: "renal"
- Condition: "gastroenterologic"
- Condition: "respiratory"
- Condition: "cardiovascular"
- Condition: "neurologic"
- Condition: "endocrinologic"
- Condition: "ischemic heart disease"
- Condition: "congestive heart failure"
- Condition: "stroke"
- Condition: "transient ischemic attack"
- Condition: "subarachnoidal bleeding"
- Condition: "brain tumor"
- Condition: "encephalopathy"
- Condition: "meningitis"
- Condition: "allergic reactions"
- Drug: "loxapine"
- Drug: "amoxapine"
- Competing_trial: "Patients who have received an investigational drug within 30 days prior to the current agitation episode must be excluded"
- Post-eligibility: "Patients who are considered by the investigator, for any reason, to be unable to self-administer the inhalation device"